¿En qué tipo de reacción interviene típicamente el citocromo P-450 del hígado?
1. Hidratación.
2. Reducción.
3. Hidrólisis.
4. Esterificación.
5. Hidroxilación.

Respuesta correcta: 5. Hidroxilación.